Clinical trial exclusion criterion:
intrauterine hormonal apparatus

Annotated entities:
- Device: "intrauterine hormonal apparatus"